What is the basis of the methidiumpropyl-EDTA sequencing (MPE-seq) method?

methidiumpropyl-EDTA sequencing (MPE-seq), a method for the genome-wide characterization of chromatin that involves the digestion of nuclei withMPE-Fe(II) followed by massively parallel sequencing.